Clinical trial exclusion criterion:
Renal insufficiency (> 265 µmol/l)

Annotated entities:
- Condition: "Renal insufficiency"
- Non-representable: "(> 265 µmol/l)"